下列關於肺炎披衣菌（Chlamydia pneumoniae）感染的敘述，那一項錯誤？
A. 大多發生於六個月以下
B. 兒童病患的首選用藥是紅黴素類的巨分子抗生素（macrolide antibiotic）
C. 引起之肺炎臨床症狀與其他原因引起的非典型肺炎（atypical pneumonia）很難區分
D. 沒有動物宿主，藉由飛沫傳染

正確答案：A. 大多發生於六個月以下